Subjects with a history of moderate to severe psoriatic disease

The above is a clinical trial inclusion criterion. Annotated with entity spans:
Subjects with a [Temporal: history] of [Qualifier: moderate] to [Qualifier: severe] [Condition: psoriatic disease]